Clinical trial inclusion criterion:
A positive 13 C-urea breath test

Entity relations:
- Has_value("13 C-urea breath test", "positive")